Clinical trial inclusion criterion:
8. Subject is willing to remain in the clinic overnight for PK assessment on Days 0 and 8

Annotated entities:
- Parsing_Error: "8."
- Non-query-able: "Subject is willing to remain in the clinic overnight for PK assessment on Days 0 and 8"